Subject understands the investigational nature of the study and provides written, informed consent.

The above is a clinical trial inclusion criterion. Annotated with entity spans:
[Post-eligibility: Subject understands the investigational nature of the study and provides written, informed consent.]